Clinical trial inclusion criterion:
Mini-Mental status examination = 24

Annotated entities:
- Measurement: "Mini-Mental status examination"
- Value: "= 2"